Clinical trial inclusion criterion:
Age 18 to 65.

Entity relations:
- Has_value("Age", "18 to 65")